Clinical trial exclusion criterion:
Subjects with topical and/or systemic medication or mechanical devices that interfere determinedly on the results of the study (such as topical immunomodulators, punctal plugs, corticosteroids, preservative artificial tears, contact lenses).

Annotated entities:
- Drug: "systemic medication"
- Drug: "topical medication"
- Device: "mechanical devices"
- Drug: "topical immunomodulators"
- Device: "punctal plugs"
- Drug: "corticosteroids"
- Drug: "preservative artificial tears"
- Device: "contact lenses"